What is holoprosencephaly?

Holoprosencephaly is a congenital defect of the brain, median structures, and face resulting from incomplete incomplete cleavage of the primitive brain during early embryogenesis.